Clinical trial inclusion criteria:
Females 18-65 years old who undergoing colposcopic directed biopsy

Annotated entities:
- Person: "Females"
- Value: "18-65 years"
- Person: "old"
- Procedure: "colposcopic directed biopsy"
- Temporal: "undergoing"